Las proteínas nuevas destinadas a la secreción se sintetizan en:
1. Aparato de Golgi.
2. Retículo endoplásmico liso.
3. Polisomas libres.
4. Núcleo.
5. Retículo endoplásmico rugoso.

Respuesta correcta: 5. Retículo endoplásmico rugoso.